Can be previously treated with Depo-Lupron, Depo-Provera, or Oral Contraceptive pills

The above is a clinical trial inclusion criterion. Annotated with entity spans:
Can be [Temporal: previously] [Procedure: treated] with [Drug: Depo-Lupron], [Drug: Depo-Provera], or [Drug: Oral Contraceptive pills]